Subjects were to have a negative screen for HIV I and II, HBsAg, and antibody to Hepatitis C virus.

The above is a clinical trial inclusion criterion. Annotated with entity spans:
Subjects were to have a [Value: negative] [Measurement: screen for HIV I] and II, [Measurement: HBsAg], and [Measurement: antibody to Hepatitis C virus].